Clinical trial exclusion criterion:
Legally incompetent or mentally impaired (e.g., minors, Alzheimer's subjects, dementia, etc.)

Annotated entities:
- Observation: "Legally incompetent"
- Condition: "mentally impaired"
- Person: "minors"
- Condition: "Alzheimer's"
- Condition: "dementia"